Acute heart failure or acute exacerbation of chronic heart failure within the past 2 weeks.

The above is a clinical trial exclusion criterion. Annotated with entity spans:
[Condition: Acute heart failure] or [Qualifier: acute] [Condition: exacerbation] of [Condition: chronic heart failure] [Temporal: within the past 2 weeks].